Clinical trial inclusion criterion:
health status compatible with detention in police cells

Entity relations:
- Has_value("health status", "compatible with detention in police cells")